How are SAHFS created?

Senescent cells have a distinct gene expression profile, which is often accompanied by the spatial redistribution of heterochromatin into senescence-associated heterochromatic foci (SAHFs). Their creation goes through the senescence stimulated depletion of LMNB1, which   facilitates the nuclear rearrangement of repressive histone marks H3K9me3 and H3K27me3 into nonoverlapping structural layers which characterize senescence-associated heterochromatic foci (SAHF).